Pregnancy induced hypertension

The above is a clinical trial exclusion criterion. Annotated with entity spans:
[Qualifier: Pregnancy induced] [Condition: hypertension]